目前臺灣的新生兒篩檢已經全面性使用串聯質譜儀篩檢，分析胺基酸以及 acylcarnitines。後者包括長鏈的脂肪酸 carnitine 複合物，以及短鏈的有機酸 carnitine 複合物。下列那一項疾病不在篩檢的範圍內？
A. 苯酮尿症（phenylketonuria）
B. 黑尿症（alkaptonuria）
C. 楓糖尿症（maple syrup urine disease）
D. 甲基丙二酸血症（methylmalonic acidemia）

正確答案：B. 黑尿症（alkaptonuria）